Clinical trial exclusion criterion:
Major congenital defects or serious chronic illness.

Entity relations:
- OR("Major congenital defects", "serious chronic illness")